Body mass index 25-35 kg/m2

The above is a clinical trial inclusion criterion. Annotated with entity spans:
[Measurement: Body mass index] [Value: 25-35 kg/m2]